secondary adhesive capsulitis (history of significant trauma, rotator cuff tear injury, stroke)

The above is a clinical trial exclusion criterion. Annotated with entity spans:
[Qualifier: secondary] [Condition: adhesive capsulitis] ([Temporal: history] of [Qualifier: significant] [Condition: trauma], [Condition: rotator cuff tear injury], [Condition: stroke])